一位 70 歲男性因突發高燒及意識不清被送至醫院，理學檢查發現有明顯黃疸，血清總膽紅素及直接型膽紅素分別為 9.5 mg/dL 及 4.2 mg/dL，腹部超音波檢查發現有膽結石及總膽管與肝內膽管之顯著擴張，膽囊也脹大，請問應該立即為病患安排下列那一種處置最為恰當？
A. 抽血檢驗 B 型及 C 型肝炎
B. 安排緊急外科手術治療切除膽囊
C. 安排緊急膽道內視鏡並引流治療
D. 肝臟切片

正確答案：C. 安排緊急膽道內視鏡並引流治療